Human dihydroorotate dehydrogenase is a drug target and is involved in what biosynthetic pathway

Dihydroorotate dehydrogenase (DHODH) catalyzes the fourth reaction of the de novo pyrimidine biosynthetic pathway, which exerts vital functions in the cells, especially within DNA and RNA biosynthesis.